做頸部血管的超音波檢查時，發現有些人的內頸動脈已完全阻塞，但其中風症狀輕微或並沒有中風症狀，最可能的原因是：
A. 患者的心律不整控制得很好
B. 患者的高血壓控制得很好
C. 患者的腦血管產生足夠的側枝循環
D. 患者長期服用抗血小板凝集藥物

正確答案：C. 患者的腦血管產生足夠的側枝循環